Explain the association between Barr bodies (nuclear inclusions) and the X chromosome?

A Barr body (named after discoverer Murray Barr) is an inactive X chromosome in a cell with more than one X chromosome, rendered inactive in a process called lyonization, in species with XY sex-determination (including humans).